Clinical trial exclusion criterion:
Ocular surgical procedures 3 months before the protocol inclusion

Entity relations:
- Has_index("3 months before the protocol inclusion", "protocol inclusion")
- Has_temporal("Ocular surgical procedures", "3 months before the protocol inclusion")
- Has_index("3 months before the protocol inclusion", "protocol inclusion")